Clinical trial exclusion criterion:
Inability to complete 400 m walk within 15 minutes without sitting or interpersonal assistance, as an indicator of disablement and likely inability to fully engage in the exercise intervention

Entity relations:
- OR("Inability to complete 400 m walk within 15 minutes without sitting", "interpersonal assistance Inability to complete 400 m walk within 15 minutes without")